一個足月嬰兒出生後哭聲洪亮、四肢活動力好、全身膚色紅潤、心跳大約140/分 、呼吸40/分，抽吸刺激時會有打噴嚏反應，他的Apgar Score為幾分？
A. 4
B. 6
C. 8
D. 10

正確答案：D. 10